Clinical trial exclusion criterion:
Patient has had previous eradication therapy of Helicobacter pylori infection.

Annotated entities:
- Temporal: "previous"
- Procedure: "eradication therapy"
- Condition: "Helicobacter pylori infection"